Clinical trial exclusion criterion:
Previous treatment on this study or with a fibroblast growth factor

Entity relations:
- Has_temporal("treatment", "Previous")
- AND("treatment", "fibroblast growth factor")